Clinical trial exclusion criterion:
History of neurologic deficit.

Annotated entities:
- Condition: "neurologic deficit"
- Temporal: "History"